Clinical trial inclusion criterion:
Healthy postmenopausal women with 50 or more moderate to severe hot flushes.

Entity relations:
- AND("50 or more", "moderate to severe hot flushes")